Clinical trial inclusion criterion:
Mini-Mental State Exam = 24.

Annotated entities:
- Measurement: "Mini-Mental State Exam"
- Value: "= 24"